Las topoisomerasas:
1. Modifican el grado de superenrrollamiento del ADN.
2. Son un tipo de ADN polimerasas.
3. Se unen al ADN monohebra para impedir que se forme la doble hélice.
4. Presentan actividad exonucleasa.
5. Sintetizan dNTPs.

Respuesta correcta: 1. Modifican el grado de superenrrollamiento del ADN.